A SLEDAI score is associated with Systemic Lupus Erythematosus. What is a SLEDAI score?

Disease activity of SLE was evaluated according to the SLE Disease Activity Index (SLEDAI) score.